Clinical trial exclusion criterion:
Peripheral vascular disease

Annotated entities:
- Condition: "Peripheral vascular disease"